有關股骨頭缺血性壞死（osteonecrosis of femoral head），下列敘述何者最正確？
A. 股骨頭X光出現subchondral cyst是初期的變化
B. 當病人出現軟骨下崩塌（subchondral collapse）時，中心減壓術（core decompression）  	是最好的治療方法
C. 最常見的原因是創傷性引起
D. 股骨頭內骨髓腔壓力（intraosseous pressure）通常不會升高

正確答案：A. 股骨頭X光出現subchondral cyst是初期的變化